Males or females above the age of 18

The above is a clinical trial inclusion criterion. Annotated with entity spans:
[Person: Males] or [Person: females] [Value: above the age of 18]